Clinical trial inclusion criteria:
Female age 20-50 y/o who plan to undergo abdominal myomectomy for symptomatic myomatous uterus

Annotated entities:
- Person: "Female"
- Person: "age"
- Value: "20-50 y/o"
- Mood: "plan to undergo"
- Procedure: "abdominal myomectomy"
- Qualifier: "symptomatic"
- Condition: "myomatous uterus"